有一慢性過敏性病人長期服用類固醇（steroid），不慎感染糞桿線蟲（Strongyloides stercoralis），且 因自體感染（autoinfection）導致重度感染（hyperinfection）下列敘述那一項錯誤？
A. 引起重度感染主因為該病人免疫抑制
B. 蟲體大量寄生在腸道內，不會有異位寄生的現象（ectoparasitism）
C. 可能併發腦炎
D. 末梢血液嗜伊紅性白血球不會顯著增加

正確答案：B. 蟲體大量寄生在腸道內，不會有異位寄生的現象（ectoparasitism）